一位 45 歲男性病人，斷斷續續嚴重胃部疼痛及每日多次腹瀉約 8 個月求診，病人無特殊藥物史及過去病史。泛內視鏡檢查發現嚴重食道炎、多處胃潰瘍及十二指腸第二部分多處潰瘍，下列疾病中鑑別診斷首要考慮之疾病為：
A. insulinoma
B. Zollinger-Ellison syndrome
C. Whipple's disease
D. Crohn's disease

正確答案：B. Zollinger-Ellison syndrome